一位60歲男性最近數月出現漸進性喘及活動後胸悶情形，至心臟內科門診求診。經過一系列檢查後，發現有擴張性心肌症合併心衰竭。以下何者錯誤？
A. 可能原因有很多種，包括感染、毒物、代謝性疾病或家族遺傳性
B. 心臟超音波可見擴張左心室以及心臟收縮功能減弱
C. 若病患合併有左束枝傳導阻斷（left bundle branch block），給予心臟再同步化節律器（cardiac resynchronization pacing）置放後可改善心臟收縮功能
D. 藥物治療無法讓心臟收縮功能改善

正確答案：D. 藥物治療無法讓心臟收縮功能改善